Clinical trial inclusion criterion:
Subject agreed to follow the protocol

Annotated entities:
- Informed_consent: "Subject agreed to follow the protocol"